Clinical trial exclusion criterion:
Acute coronary syndrome in the past 6 months

Annotated entities:
- Condition: "Acute coronary syndrome"
- Temporal: "in the past 6 months"